Paroxysmal atrial fibrillation.

The above is a clinical trial exclusion criterion. Annotated with entity spans:
[Condition: Paroxysmal atrial fibrillation].